根據公式，當一位病人的總膽固醇為 287 mg/dL，三酸甘油酯為 175 mg/dL 及高密度脂蛋白膽固醇 （HDL-C）為 90 mg/dL 時，計算出來的低密度脂蛋白膽固醇（LDL-C）值為多少？
A. 22 mg/dL
B. 85 mg/dL
C. 130 mg/dL
D. 162 mg/dL

正確答案：D. 162 mg/dL